Indica cuál de las siguientes es una alteración del metabolismo de las pirimidinas:
1. Trombofilia.
2. Fenilcetonuria.
3. Enfermedad de Wilson.
4. Enfermedad de la orina con olor a Jarabe de arce.
5. Aciduria orótica hereditaria.

Respuesta correcta: 5. Aciduria orótica hereditaria.